Left ventricular hypertrophy by echocardiography or ECG

The above is a clinical trial exclusion criterion. Annotated with entity spans:
[Condition: Left ventricular hypertrophy] by [Procedure: echocardiography] or [Procedure: ECG]